Clinical trial exclusion criterion:
Subjects who are pregnant or nursing.

Entity relations:
- OR("pregnant", "nursing")